Clinical trial inclusion criterion:
Nonsurgical neonates and babies up to age 6 months with INR 1.5 or more who are deemed clinically to need plasma infusion.

Entity relations:
- Has_value("age", "up to age 6 months")
- Has_value("INR", "1.5 or more")
- AND("need", "plasma infusion")
- AND("neonates", "Nonsurgical")
- AND("babies", "age")
- OR("neonates", "babies")